Acute coronary syndrome within 1 month

The above is a clinical trial exclusion criterion. Annotated with entity spans:
[Condition: Acute coronary syndrome] [Temporal: within 1 month]